Clinical trial exclusion criterion:
Recent stroke or heart attack.

Annotated entities:
- Condition: "stroke"
- Condition: "heart attack"
- Temporal: "Recent"